Natalizumab [anti-α4 integrin (anti-VLA-4) monoclonal antibody]目前已證實可以用來治療何種疾病？
A. multiple sclerosis
B. metastatic melanoma
C. chronic myeloid leukemia
D. chronic asthma

正確答案：A. multiple sclerosis